Clinical trial exclusion criterion:
Drug allergies: Any adverse reaction including immediate or delayed hypersensitivity to any intranasal, inhaled, or systemic corticosteroid therapy. Known or suspected sensitivity to the constituents of the ELLIPTA Inhaler (i.e., lactose, FF).

Annotated entities:
- Condition: "Drug allergies"
- Drug: "intranasal corticosteroid"
- Drug: "systemic corticosteroid"
- Drug: "inhaled corticosteroid"
- Condition: "immediate hypersensitivity"
- Condition: "delayed hypersensitivity"
- Condition: "adverse reaction"
- Condition: "sensitivity"
- Drug: "constituents of the ELLIPTA Inhaler"
- Drug: "lactose"
- Drug: "FF"